Hemodynamic instability

The above is a clinical trial exclusion criterion. Annotated with entity spans:
[Condition: Hemodynamic instability]